長期側躺的病人最常發生褥瘡的位置在下列何部位？
A. 髂嵴（iliac crest）
B. 股骨大粗隆（greater trochanter of femur）
C. 肩部（shoulder）
D. 腳踝（ankle）

正確答案：B. 股骨大粗隆（greater trochanter of femur）